Las moléculas MHC (complejo principal de histocompatibilidad) de clase I presentan péptidos (procedentes de antígenos procesados), que se localizan en la hendidura formada entre:
1. Los dominios alfa-1 y alfa-2 de la cadena alfa.
2. Los dominios alfa-2 y alfa-3 de la cadena alfa.
3. El dominio alfa-1 y la beta-2microglobulina.
4. El dominio alfa-3 y la beta-2microglobulina.

Respuesta correcta: 1. Los dominios alfa-1 y alfa-2 de la cadena alfa.